Clinical trial inclusion criterion:
Able to walk and complete lower-limb tests with both legs

Annotated entities:
- Condition: "Able to walk"
- Condition: "Able to complete lower-limb tests"
- Qualifier: "with both legs"